Coagulation disorders

The above is a clinical trial exclusion criterion. Annotated with entity spans:
[Condition: Coagulation disorders]